Can achieve a distance visual acuity of 20/30 (0.18 logMAR) or better in each eye with the study contact lenses.

The above is a clinical trial inclusion criterion. Annotated with entity spans:
Can achieve a [Measurement: distance visual acuity] of [Value: 20/30] ([Value: 0.18 logMAR]) or better in each eye with the [Device: study contact lenses].